antipsychotics or other dopamine antagonists

The above is a clinical trial exclusion criterion. Annotated with entity spans:
[Drug: antipsychotics] or other [Drug: dopamine antagonists]